一位 60 歲的男性急性心肌梗塞發作，經急救人員施救後送來急診室。抽血檢驗發現：血中的pH 7.12， 58 mmHg，血中的HCO3- 為 18 mEq/L，下列有關他體內酸鹼平衡的敘述，何者正確？
A. 呼吸性酸中毒（respiratory acidosis）合併部分性腎代償
B. 代謝性酸中毒（metabolic acidosis）合併部分性呼吸代償
C. 呼吸性酸中毒合併代謝性酸中毒
D. 呼吸性鹼中毒（respiratory alkalosis）合併代謝性鹼中毒（metabolic alkalosis）

正確答案：C. 呼吸性酸中毒合併代謝性酸中毒